La desviación de la ley de Beer por uso de radiación no monocromática puede dar lugar a desviaciones de la linealidad al representar la absorbancia frente a la concentración debido a:
1. Distintas absortividades molares de las especies absorbentes.
2. Muy parecidas absortividades molares de las radiaciones del haz policromático.
3. Que la potencia radiante del haz incidente se modifica.
4. Que la utilización de un haz policromático siempre implica diferencias significativas respecto a uno monocromático.
5. Que la relación de potencias incidente y transmitida es distinta.

Respuesta correcta: 1. Distintas absortividades molares de las especies absorbentes.